El uso más común del ELISA indirecto es la cuantificación de:
1. Proteínas séricas.
2. La citotoxicidad mediada por linfocitos NK.
3. La activación del complemento.
4. Anticuerpos específicos en un suero.
5. Apoptosis.

Respuesta correcta: 4. Anticuerpos específicos en un suero.